Clinical trial exclusion criterion:
The ulcer have been treated with growth factors in the last 8 weeks

Annotated entities:
- Condition: "ulcer"
- Procedure: "treated"
- Drug: "growth factors"
- Temporal: "in the last 8 weeks"